Clinical trial inclusion criterion:
Life expectancy > 12 weeks.

Annotated entities:
- Observation: "Life expectancy"